La causa más frecuente de hemoptisis levemoderada es:
1. Bronquiectasias.
2. Carcinoma broncogénico.
3. Diátesis hemorrágica.
4. Infarto pulmonar.
5. Neumonía.

Respuesta correcta: 1. Bronquiectasias.